Clinical trial inclusion criterion:
A positive scrub typhus RDT (Scrub Typhus IgM RDT, InBios International, Seattle, WA, USA) and/or positive PCR-based detection of O. tsutsugamushi DNA from the admission blood sample

Annotated entities:
- Measurement: "scrub typhus RDT"
- Value: "positive"
- Procedure: "Scrub Typhus IgM RDT"
- Value: "positive"
- Procedure: "PCR"
- Qualifier: "O. tsutsugamushi DNA"
- Qualifier: "admission blood sample"